下列有關眼睛睫狀體（ciliary body）功能的敘述，何者錯誤？
A. 產生眼房液（aqueous humor）
B. 支撐懸吊晶狀體（lens）
C. 調節進入眼球的光量
D. 調整晶狀體（lens）的厚度

正確答案：C. 調節進入眼球的光量